Una coenzima es:
1. Una molécula de naturaleza orgánica, necesaria para la actividad de una enzima.
2. La parte inorgánica de una enzima.
3. Una molécula de naturaleza proteica, necesaria para la actividad de una enzima.
4. Cualquier molécula de naturaleza no vitamínica que contribuya a aumentar la actividad de una enzima.
5. Un efecto alostérico que modifica la configuración espacial de las enzimas.

Respuesta correcta: 1. Una molécula de naturaleza orgánica, necesaria para la actividad de una enzima.